In which cells does TLR7 escape X-chromosome inactivation?

TLR7 escape X-chromosome inactivation by RNA polymerase II (ChIP-seq) DNA methylation to produce active TLR7 in immune cells